Clinical trial inclusion criterion:
No previous history of upper gastrointestinal bleeding

Entity relations:
- Has_negation("upper gastrointestinal bleeding", "No")